Clinical trial inclusion criteria:
Patients of familial cases of POF :
Female subjects between 16 and 40 years or women older than 40 years with a cessation of ovarian function before the age of 40 years with increased levels of FSH
Primary or secondary amenorrhea for more than three months with LH and FSH> 30mUI/ml
No cases of fragile X syndrome in the family or blepharophimosis syndrome
At least two cases in the family
Origin Caucasian
Patient signing the consent form for at least the blood sample
Patient with Social Security
Population Index related topics :
The presence of cycles until the age of 40 years with proven fertility, at least one child
Amenorrhea and FSH> 30mUI/ml according to the criteria of the index subject
Men of the family of index case
Population control :
Women of Caucasian origin
Women who had regular cycles until at least age 40 and at least one child
Lack of land autoimmune (no history of thyroid disease or diabetes type 1)
Woman signing the consent form for at least the blood sample

Annotated entities:
- Parsing_Error: "Patients of familial cases of POF :"
- Person: "Female"
- Value: "between 16 and 40 years"
- Value: "older than 40 years"
- Person: "years"
- Person: "women"
- Reference_point: "older"
- Condition: "cessation of ovarian function"
- Value: "before the age of 40 years"
- Person: "age"
- Value: "increased"
- Measurement: "levels of FSH"
- Condition: "amenorrhea"
- Qualifier: "secondary"
- Qualifier: "Primary"
- Temporal: "for more than three months"
- Measurement: "LH"
- Measurement: "FSH"
- Value: "> 30mUI/ml"
- Condition: "fragile X syndrome"
- Observation: "in the family"
- Condition: "blepharophimosis syndrome"
- Negation: "No"
- Multiplier: "At least two"
- Undefined_semantics: "cases in the family"
- Parsing_Error: "cases in the family"
- Condition: "Caucasian"
- Post-eligibility: "Patient signing the consent form for at least the blood sample"
- Non-query-able: "Patient with Social Security"
- Parsing_Error: "Population Index related topics :"
- Condition: "presence of cycles"
- Value: "until the age of 40 years"
- Person: "age"
- Pregnancy_considerations: "The presence of cycles until the age of 40 years with proven fertility, at least one child"
- Condition: "Amenorrhea"
- Measurement: "FSH"
- Value: "> 30mUI/ml"
- Not_a_criteria: "Men of the family of index case"
- Not_a_criteria: "Population control :"
- Parsing_Error: "Population control :"
- Condition: "Caucasian origin"
- Person: "Women"
- Person: "Women"
- Condition: "regular cycles"
- Value: "until at least age 40"
- Person: "age"
- Condition: "who had regular cycles until at least age 40"
- Condition: "autoimmune"
- Condition: "thyroid disease"
- Condition: "diabetes type 1"
- Negation: "no"
- Temporal: "history"
- Grammar_Error: "Lack of land"
- Post-eligibility: "Woman signing the consent form for at least the blood sample"